Clinical trial exclusion criterion:
Systemic or ocular medications that may confound the outcome of the intervention

Annotated entities:
- Drug: "ocular medications"
- Drug: "Systemic medications"
- Qualifier: "may confound the outcome of the intervention"